Written informed consent signed and agreed to receive periodic follow-up

The above is a clinical trial inclusion criterion. Annotated with entity spans:
[Post-eligibility: Written informed consent signed and agreed to receive periodic follow-up]